Clinical trial exclusion criterion:
Current or previous, within the 60 days preceding the baseline visit (Visit 2), treatment with antimuscarinic agents for OAB symptoms; and, willingness to not use antimuscarinic agents for the duration of the study.

Annotated entities:
- Drug: "antimuscarinic agents"
- Condition: "OAB symptoms"
- Temporal: "within the 60 days preceding the baseline visit"
- Reference_point: "baseline visit"
- Post-eligibility: "willingness to not use antimuscarinic agents for the duration of the study"